Clinical trial exclusion criterion:
Current or recent infection

Annotated entities:
- Temporal: "recent"
- Temporal: "Current"
- Condition: "infection"